一位 30 歲婦女因結婚 5 年後一直無法懷孕而就診。她抱怨過去在月經期常有腹痛情形發生。身體檢查並無任何異常。腹腔鏡檢查發現在子宮及兩側卵巢的表面有許多約 2-5 毫米的出血病變。下列病變中，何者最可能出現在此位婦女的卵巢？
A. 子宮內膜樣囊腫（Endometriotic cyst）
B. 克魯肯氏腫瘤（Krukenberg tumor）
C. 成熟囊狀畸胎瘤（Mature cystic teratoma）
D. 多囊性卵巢疾病（Polycystic ovarian disease）

正確答案：A. 子宮內膜樣囊腫（Endometriotic cyst）